Clinical trial exclusion criterion:
Concurrently participating in another clinical study, at any time during the study period, in which the subject has been or will be exposed to an investigational or a non-investigational vaccine/product

Entity relations:
- Has_temporal("participating in clinical study", "Concurrently")
- Has_temporal("participating in clinical study", "at any time during the study period")
- Has_index("at any time during the study period", "the study period")
- Has_qualifier("vaccine", "investigational")
- AND("participating in clinical study", "vaccine")
- OR("vaccine", "product")
- OR("investigational", "non-investigational")